La dependencia/independencia de campo es:
1. Un rasgo de personalidad bipolar relativo a la autonomía social.
2. Un estilo cognitivo vinculado a la percepción con implicaciones en campos diversos como el aprendizaje.
3. Una capacidad intelectual necesaria para la toma de decisiones en la resolución de problemas cognitivos complejos.
4. Un componente básico de la Teoría Tríadica de la Inteligencia de Sternberg, relativo al mundo interno de la persona.

Respuesta correcta: 2. Un estilo cognitivo vinculado a la percepción con implicaciones en campos diversos como el aprendizaje.